Clinical trial inclusion criterion:
no previous protease inhibitor resistance documented on HIV-1 genotypic resistance testing

Annotated entities:
- Drug: "protease inhibitor"
- Condition: "protease inhibitor resistance"
- Procedure: "HIV-1 genotypic resistance testing"
- Condition: "HIV-1"
- Condition: "HIV-1 genotypic resistance"